Have a diagnosis of schizophrenia or other major psychiatric diagnosis or mental illness (e.g. major depression)

The above is a clinical trial exclusion criterion. Annotated with entity spans:
Have a diagnosis of [Condition: schizophrenia] or other [Condition: major psychiatric diagnosis] or [Condition: mental illness] (e.g. [Condition: major depression])